Clinical trial exclusion criterion:
Possible pregnancy (confirmed by urine test)

Entity relations:
- Has_mood("pregnancy", "Possible")
- Has_value("urine test", "confirmed")
- AND("pregnancy", "urine test")